History of allergy or intolerance to any of the study drugs

The above is a clinical trial exclusion criterion. Annotated with entity spans:
[Temporal: History] of [Condition: allergy] or [Condition: intolerance] to any of the [Drug: study drugs]